Hemochromatosis, iron overload, defined as TSAT > 45%

The above is a clinical trial exclusion criterion. Annotated with entity spans:
[Condition: Hemochromatosis], [Condition: iron overload], defined as [Measurement: TSAT] [Value: > 45%]